La monitorización de la Presión Venosa Central (PVC) es un procedimiento realizado con frecuencia por las enfermeras de la Unidad de Cuidados Críticos. Señale la opción correcta respecto al desempeño de esta medición hemodinámica:
1. Solo es posible realizarla mediante el empleo de transductores electrónicos de presión, expresándose la medida en cmH2O.
2. Solo es posible llevarla a cabo mediante el empleo de transductores electrónicos de presión, expresándose la medida en mmHg.
3. Solo se puede realizar a través de la luz distal de un catéter de arteria pulmonar.
4. Se puede realizar mediante el empleo de transductores electrónicos de presión y manómetros con columna de agua.
5. Es un buen reflejo del funcionamiento del ventrículo izquierdo.

Respuesta correcta: 4. Se puede realizar mediante el empleo de transductores electrónicos de presión y manómetros con columna de agua.